Dan forma y estabilidad a la envoltura nuclear:
1. Ran GTPasa.
2. Laminas nucleares.
3. Nucleoporinas.
4. Filamina.

Respuesta correcta: 2. Laminas nucleares.